下列關於糖尿病多發性神經病變（diabetic polyneuropathy），何者錯誤？
A. 常先以感覺症狀為主
B. 常先影響小的神經纖維
C. 神經傳導檢查正常，即可排除此診斷
D. 一旦出現，即使糖尿病嚴格控制，也常是不可逆的變化

正確答案：C. 神經傳導檢查正常，即可排除此診斷